若病患之體循環動脈血含氧量為 0.20 mL O2/mL blood，肺動脈血含氧量為 0.15 mL O2/mL blood，而其全身耗氧量為 200 mL/min，則病患之心輸出量為多少 mL/min？
A. 5000
B. 4000
C. 2000
D. 1000

正確答案：B. 4000